Clinical trial inclusion criterion:
Onset of symptoms < 3 hours prior to randomisation

Entity relations:
- Has_index("< 3 hours prior to randomisation", "randomisation")
- Has_temporal("Onset of symptoms", "< 3 hours prior to randomisation")